下列那一種口服的 opioid 具有最長的半生期（half life）？
A. codeine
B. morphine
C. oxycodone
D. methadone

正確答案：D. methadone